Clinical trial inclusion criterion:
(1) cases of infertility, older than 20 years of age and not older than 40 years.

Annotated entities:
- Condition: "infertility"
- Value: "older than 20 years"
- Person: "age"
- Value: "not older than 40 years"